國小學童於學校食用營養午餐後一至六小時，陸續發生多位學童出現噁心、嘔吐及腹瀉之食物中毒群聚事件。鑑別診斷中，除考慮 Staphylococcus aureus 為可能病原外，下列何者亦是最可能病原？
A. Bacillus cereus
B. Campylobacter jejuni
C. Salmonella spp.
D. Vibrio parahemolyticus

正確答案：A. Bacillus cereus